Clinical trial inclusion criterion:
Scheduled back surgery

Annotated entities:
- Mood: "Scheduled"
- Procedure: "back surgery"